下列何種病毒不屬於腸病毒屬（Genus enterovirus）？
A. 脊髓灰白質炎病毒（Poliovirus）
B. 輪狀病毒（Rotavirus）
C. 克沙奇病毒（Coxsackie virus）
D. 埃可病毒（Echovirus）

正確答案：B. 輪狀病毒（Rotavirus）